Clinical trial inclusion criterion:
Patients must be either medication treatment naïve for behavioral illnesses or have no active medication treatments for at least 1 month prior to enrollment. Prohibited medications at the time of enrollment will include stimulants, benzodiazepines and THC. Prior therapy with these agents is permitted with a washout of >30 days.

Entity relations:
- Has_negation("medication", "naïve")
- AND("behavioral illnesses", "medication")
- Has_qualifier("medication", "active")
- Has_negation("medication", "no")
- Has_temporal("medication", "for at least 1 month prior to enrollment")
- OR("stimulants", "benzodiazepines", "THC")